在臺灣，下列何種類型的醫療糾紛適用無過失補償？
A. 疫苗傷害
B. 整型美容傷害
C. 植牙傷害
D. 復健傷害

正確答案：A. 疫苗傷害